Objection to blood draw or application of blood products

The above is a clinical trial exclusion criterion. Annotated with entity spans:
[Non-query-able: Objection to blood draw or application of blood products]